Clinical trial exclusion criterion:
Infection

Annotated entities:
- Condition: "Infection"